Clinical trial exclusion criterion:
History of "Major Bleeding" at any point (defined as overt bleeding at a critical site including intracranial, intraspinal, intraocular, pericardial, or retroperitoneal; or bleed requiring hospitalization).

Entity relations:
- Has_temporal("Major Bleeding", "at any point")
- Has_temporal("Major Bleeding", "History")
- Has_qualifier("overt bleeding", "critical site")
- AND("bleed", "hospitalization")
- Subsumes("critical site", "intracranial")
- Subsumes("Major Bleeding", "overt bleeding")
- OR("intracranial", "pericardial", "intraocular", "intraspinal", "retroperitoneal")
- OR("overt bleeding", "bleed")